The patient has received chemotherapy or immunotherapy for primary tumors

The above is a clinical trial exclusion criterion. Annotated with entity spans:
The patient has received [Procedure: chemotherapy] or [Procedure: immunotherapy] for [Condition: primary tumors]